En relación a la toxoplasmosis y el embarazo, indique cuál de las siguientes opciones es cierta:
1. Se puede producir transmisión placentaria al feto.
2. Debe detectarse la tasa de anticuerpos al inicio de la gestación y, en su ausencia, efectuar vacunación con vacuna de virus muertos.
3. La infección es menos grave pero más frecuente cuanto más joven es la gestante.
4. En nuestro medio, la principal causa de contagio es la convivencia y el manejo de aves domésticas.
5. El contagio ocurre intraparto, favorecido por la rotura de la bolsa amniótica.

Respuesta correcta: 1. Se puede producir transmisión placentaria al feto.